依我國安寧緩和醫療條例規範，民眾可簽署「預立選擇安寧緩和醫療意願書」、「預立不施行心肺復甦意願書」、「預立醫療委任代理人」等醫療預立指示，下列何項不是簽署者之必要條件？
A. 年滿 20 歲以上
B. 具有完全行為能力者
C. 意識清楚
D. 疾病末期

正確答案：D. 疾病末期